有關肝炎病毒中，下列何者與黃熱病毒（yellow fever virus）屬同一科？
A. Hepatitis A virus
B. Hepatitis B virus
C. Hepatitis C virus
D. Hepatitis D virus

正確答案：C. Hepatitis C virus